Clinical trial inclusion criterion:
Be medically stable.

Annotated entities:
- Condition: "medically stable"